Clinical trial exclusion criterion:
Allergic to contrast

Entity relations:
- AND("Allergic", "contrast")